Ability to measure atrial and/or ventricular pacing threshold(s) at 0.4 or 0.5 ms

The above is a clinical trial inclusion criterion. Annotated with entity spans:
[Post-eligibility: Ability to measure atrial and/or ventricular pacing threshold(s) at 0.4 or 0.5 ms]